Clinical trial inclusion criterion:
With confirmed diagnosis of stage II colon cancer.

Entity relations:
- Has_qualifier("colon cancer", "stage II")